La azaserina es un antagonista:
1. De la glutamina.
2. Utilizado en el tratamiento de la infección por herpesvirus.
3. Utilizado en el tratamiento de la leucemia aguda.
4. Inmunosupresor.

Respuesta correcta: 1. De la glutamina.